Clinical trial inclusion criterion:
RTV to COBI/COBI-containing fixed-dose combination regimens

Entity relations:
- AND("COBI-containing fixed-dose combination regimens", "COBI")
- AND("COBI-containing fixed-dose combination regimens", "RTV")